Clinical trial exclusion criterion:
Patient who sign for single port gynecologic laparoscopic surgery or NOTE surgery

Annotated entities:
- Qualifier: "single port"
- Procedure: "gynecologic laparoscopic surgery"
- Procedure: "NOTE surgery"